Clinical trial exclusion criterion:
Pathological dry eye or associated findings

Annotated entities:
- Condition: "Pathological dry eye"
- Condition: "associated findings"